Which drugs are included in the CNIC polypill?

CNIC polypill includes atorvastatin 40mg, ramipril 10mg and aspirin 100mg.